Clinical trial exclusion criterion:
Tubal ligation and infertility surgery

Annotated entities:
- Procedure: "Tubal ligation"
- Procedure: "infertility surgery"